La vitamina que regula los niveles de calcio en la sangre y tiene un papel importante en el funcionamiento saludable de nervios y músculos es:
1. Vitamina E.
2. Vitamina A.
3. Vitamina K.
4. Vitamina D.

Respuesta correcta: 4. Vitamina D.